Type 1 diabetes mellitus,presence of autoimmune diabetes indicated by antibodies to insulin, islet cells, and GAD;

The above is a clinical trial exclusion criterion. Annotated with entity spans:
[Condition: Type 1 diabetes mellitus],presence of [Condition: autoimmune diabetes] indicated by [Condition: antibodies] to [Qualifier: insulin], [Qualifier: islet cells], and [Qualifier: GAD];